Clinical trial inclusion criteria:
Accepted for CABG surgery
Treatment with Ticagrelor within 48 hours

Annotated entities:
- Procedure: "CABG surgery"
- Mood: "Accepted for"
- Drug: "Ticagrelor"
- Temporal: "within 48 hours"
- Procedure: "Treatment"